Umbilical hernia

The above is a clinical trial exclusion criterion. Annotated with entity spans:
[Condition: Umbilical hernia]